irritable bowel syndrome

The above is a clinical trial exclusion criterion. Annotated with entity spans:
[Condition: irritable bowel syndrome]